Clinical trial exclusion criterion:
previous treated dupuytrens contracture same hand

Annotated entities:
- Temporal: "previous"
- Qualifier: "treated"
- Condition: "dupuytrens contracture"
- Qualifier: "same hand"